Clinical trial exclusion criterion:
Low or high amount of calcium in blood

Annotated entities:
- Value: "Low amount"
- Value: "high amount"
- Measurement: "calcium in blood"